Clinical trial inclusion criterion:
Ability to understand and the willingness to sign a written informed consent document

Annotated entities:
- Post-eligibility: "Ability to understand and the willingness to sign a written informed consent document"